有關成人型多囊腎（adult polycystic kidney）的敘述，下列何者錯誤？
A. 是末期腎衰竭的原因之一
B. 經常合併有肝囊腫（hepatic cysts）
C. 症狀常在30至50歲之間才變得明顯
D. 多數病人屬於退化性疾病，與遺傳無關

正確答案：D. 多數病人屬於退化性疾病，與遺傳無關